一位普拿疼（acetaminophen）中毒之病人在第三天出現皮膚變黃、深茶色尿，最可能是何種毒性作用所致？
A. 肝毒性（hepatotoxicity）
B. 心毒性（cardiotoxicity）
C. 神經毒性（neurotoxicity）
D. 腎毒性（nephrotoxicity）

正確答案：A. 肝毒性（hepatotoxicity）